Use of prazosin or other alpha-1 antagonist (including but not limited to alfuzosin, doxazosin, silodosin, tamsulosin, terazosin) for any purpose in the 2 weeks prior to initial screen (P1) visit and prohibited throughout the study

The above is a clinical trial exclusion criterion. Annotated with entity spans:
Use of [Drug: prazosin] or [Qualifier: other] [Drug: alpha-1 antagonist] (including but not limited to [Drug: alfuzosin], [Drug: doxazosin], [Drug: silodosin], [Drug: tamsulosin], [Drug: terazosin]) for any purpose [Temporal: in the 2 weeks prior to initial screen (P1) visit] and prohibited throughout the study